Clinical trial inclusion criteria:
Fulfills NIH criteria for bariatric surgery
Planned operation of laparoscopic Roux-en Y gastric bypass (LRYGB) or laparoscopic sleeve gastrectomy (LSG) as primary bariatric procedure

Annotated entities:
- Measurement: "NIH criteria"
- Condition: "bariatric surgery"
- Value: "Fulfills"
- Procedure: "laparoscopic Roux-en Y gastric bypass (LRYGB)"
- Procedure: "laparoscopic sleeve gastrectomy (LSG)"
- Qualifier: "primary"